Presence of severe cerebrovascular disorders (diagnosis of stroke, cerebral infarction or cerebral hemorrhage within recent 6 months)

The above is a clinical trial exclusion criterion. Annotated with entity spans:
Presence of [Qualifier: severe] [Condition: cerebrovascular disorders] (diagnosis of [Condition: stroke], [Condition: cerebral infarction] or [Condition: cerebral hemorrhage] [Temporal: within recent 6 months])